Clinical trial inclusion criterion:
Radical (total) cystectomy

Annotated entities:
- Procedure: "Radical cystectomy"
- Procedure: "total cystectomy"